Active coagulation disorder not controlled with medication

The above is a clinical trial exclusion criterion. Annotated with entity spans:
[Temporal: Active] [Condition: coagulation disorder] [Negation: not] [Qualifier: controlled with medication]